下列何種男性荷爾蒙對攝護腺肥大有最直接且最重要的影響？
A. 自由型睪固酮（free form testosterone）
B. 二氫睪固酮（dihydrotestosterone）
C. 雄二酮（androstenedione）
D. 性荷爾蒙接合球蛋白（sex hormone binding globulin）接合型睪固酮

正確答案：B. 二氫睪固酮（dihydrotestosterone）